surgical interventions for PD;

The above is a clinical trial exclusion criterion. Annotated with entity spans:
[Procedure: surgical interventions for PD];